Clinical trial inclusion criterion:
receive standard neo-adjuvant chemotherapy, adjuvant chemotherapy,and standard surgical treatment

Annotated entities:
- Procedure: "standard neo-adjuvant chemotherapy"
- Procedure: "adjuvant chemotherapy"
- Procedure: "standard surgical treatment"